下列關於生物膜（biological membrane）分子構造的敘述何者為非？
A. 為 noncovalent assemblies
B. 為 symmetric
C. 為 fluid structures
D. 主要組成為 lipids 和 proteins

正確答案：B. 為 symmetric